History of heart transplantation

The above is a clinical trial exclusion criterion. Annotated with entity spans:
History of [Procedure: heart transplantation]